Señale la respuesta correcta respecto a los siguientes fármacos biológicos utilizados en el tratamiento de las enfermedades reumáticas.
1. Etanercept es un anticuerpo monoclonal quimérico contra el TNF.
2. Abatacept impide la maduración de linfocitos B a células plasmáticas
3. Anakinra es un antagonista recombinante de los receptores de IL-6.
4. Adalimumab es un anticuerpo contra el TNF completamente humano.

Respuesta correcta: 4. Adalimumab es un anticuerpo contra el TNF completamente humano.